Age greater than or equal to 18 years old

The above is a clinical trial inclusion criterion. Annotated with entity spans:
[Person: Age] [Value: greater than or equal to 18 years old]